Which receptor is targeted by Spesolimab?

Spesolimab is a novel anti-interleukin-36 receptor antibody.